Open surgery;

The above is a clinical trial exclusion criterion. Annotated with entity spans:
[Procedure: Open surgery];